Subjects with a history of hypercoagulopathy, deep vein thrombosis (DVT), pulmonary embolism

The above is a clinical trial exclusion criterion. Annotated with entity spans:
Subjects with a [Temporal: history] of [Condition: hypercoagulopathy], [Condition: deep vein thrombosis] ([Condition: DVT]), [Condition: pulmonary embolism]